Las equinocandinas son compuestos antifúngicos que actúan inhibiendo:
1. La síntesis de ergosterol.
2. La síntesis de la pared celular.
3. La síntesis del DNA.
4. La síntesis de proteínas.
5. La formación de microtúbulos.

Respuesta correcta: 2. La síntesis de la pared celular.